Clinical trial exclusion criterion:
indications to anticoagulation at the time of enrollment or predicted appearance of such indications within the duration of the trial (eg. pulmonary embolism)

Annotated entities:
- Condition: "indications"
- Procedure: "anticoagulation"
- Temporal: "at the time of enrollment"
- Mood: "predicted appearance"
- Temporal: "within the duration of the trial"
- Condition: "pulmonary embolism"